Clinical trial inclusion criterion:
Able to use independently the device required for treatment by apomorphine

Annotated entities:
- Drug: "apomorphine"
- Device: "device"